Patient not able to receive 12 months of dual anti-platelet therapy

The above is a clinical trial inclusion criterion. Annotated with entity spans:
Patient not [Condition: able to receive] [Temporal: 12 months] of [Procedure: dual anti-platelet therapy]